Clinical trial exclusion criterion:
hypersensitivity to shrimps, lobsters or beetles

Annotated entities:
- Condition: "hypersensitivity"
- Qualifier: "shrimps"
- Qualifier: "lobsters"
- Qualifier: "beetles"